進行期胃癌之肉眼觀察形態有四種。下列敘述何者錯誤？
A. type II，潰瘍外觀其邊緣隆起與周邊之黏膜界限清晰
B. type III，潰瘍外觀其邊緣隆起與周邊黏膜界限不清
C. type IV，胃壁瀰漫性浸潤無明顯之隆起或潰瘍
D. 臺灣以type II較多

正確答案：D. 臺灣以type II較多